incooperative for glucose monitor

The above is a clinical trial exclusion criterion. Annotated with entity spans:
[Condition: incooperative] for [Procedure: glucose monitor]